Which T-UCRs have been implicated in lung cancer?

Transcribed ultraconserved regions (T-UCRs) classified as long non-coding RNAs (Lnc-RNAs) are transcripts longer than 200-nt RNA with no protein-coding capacity. The clinicopathologic significance and regulatory mechanism of T-UCRs in lung cancer (LC) remain largely unknown. Uc.454 is downregulated in both non-small-cell LC (NSCLC) tissues and LC cell lines, and the downregulated uc.454 is associated with tumor size and tumors with more advanced stages. Transfection with uc.454 markedly induces apoptosis and inhibites cell proliferation in SPC-A-1 and NCI-H2170 LC cell lines. Thus uc.454 potentially plays a suppressive role in LC. Transcribed uc.339 is upregulated in archival NSCLC samples, functioning as a decoy RNA for miR-339-3p, -663b-3p, and -95-5p. As a result, Cyclin E2, a direct target of all these microRNAs is upregulated, promoting cancer growth and migration. Modulation of uc.339 affects microRNA expression. However, overexpression or downregulation of these microRNAs causes no significant variations in uc.339 levels.